Clinical trial exclusion criterion:
Current history or in past 6 months of psychotic disorder or major depressive disorders that is not stable on treatment for past 3 months

Entity relations:
- Has_qualifier("major depressive disorders", "not stable")
- Has_temporal("major depressive disorders", "for past 3 months")
- Has_temporal("psychotic disorder", "past 6 months")
- OR("psychotic disorder", "major depressive disorders")